一位 36 歲男性患者被送至急診室就醫，當時血壓 182/126 mmHg、心跳每分鐘 112次、發燒、流鼻涕、腹痛、瞳孔放大、全身肌肉抽痛。此患者最可能之臨床診斷為何？
A. 海洛因中毒（heroin intoxication）
B. K他命中毒（ketamine intoxication）
C. 安非他命戒斷（amphetamine withdrawal）
D. 海洛因戒斷（heroin withdrawal）

正確答案：D. 海洛因戒斷（heroin withdrawal）